患者 60 歲，是位老菸槍。若要診斷是否為慢性阻塞性肺病（chronic obstructive pulmonary disease），下列何者是最重要的診斷依據？
A. FEV1 / FVC<0.7
B. 胸部X光片顯示兩側肺紋增加
C. 哮鳴音
D. PaO2 < 90 mmHg

正確答案：A. FEV1 / FVC<0.7